Chronic or recurrent uveitis.

The above is a clinical trial exclusion criterion. Annotated with entity spans:
[Multiplier: Chronic] or [Multiplier: recurrent] [Condition: uveitis].